下列藥物中，何者是屬於serotonin（5-HT3）的拮抗劑，用於預防因做化療（chemotherapy）時或手術後所引 起的噁心、嘔吐？
A. methysergide
B. ketanserin
C. cyproheptadine
D. ondensetron

正確答案：D. ondensetron